最常造成自發性蜘蛛網膜下腔出血的原因是：
A. 高血壓
B. 腫瘤出血
C. 顱內動脈瘤破裂
D. 顱內動靜脈畸形破裂

正確答案：C. 顱內動脈瘤破裂